Un paciente de 82 años acude a la consulta por presentar mareos repentinos y frecuentes, sin pródromos, de corta duración y que ceden espontáneamente, sin presentar nunca síncope. La exploración física y el electrocardiograma basal son normales. En un registro ambulatorio del electrocardiograma durante 24 horas se detecta en el periodo vigil fases de corta duración de ausencia de ondas P previas al QRS con un ritmo de escape de la unión aurículo-ventricular con QRS estrecho a 40 lpm y una onda al inicio del segmento ST correspondiente a una P retrógrada. No se detectan periodos de asistolia superiores a 3 segundos. Ante esto usted diría:
1. El paciente tiene un bloqueo aurículoventricular de 3º grado y precisa la implantación de un marcapasos.
2. La ausencia de periodos de asistolia >3 segundos excluye una causa cardiaca de los mareos.
3. Estaría indicado un tratamiento farmacológico que incrementara la conducción en el nodo aurículo-ventricular.
4. El paciente presenta una disfunción sinusal con bloqueo sinoauricular y requiere, por presentar síntomas, la implantación de marcapasos.
5. Las alteraciones detectadas en el electrocardiograma ambulatorio son propias de pacientes de esta edad y no hay indicación de intervención terapéutica.

Respuesta correcta: 4. El paciente presenta una disfunción sinusal con bloqueo sinoauricular y requiere, por presentar síntomas, la implantación de marcapasos.